Life expectancy < 6 months (e.g., terminal cancer)

The above is a clinical trial exclusion criterion. Annotated with entity spans:
[Observation: Life expectancy] [Value: < 6 months] (e.g., [Condition: terminal cancer])